Clinical trial exclusion criterion:
Presence of a left ventricular assist device

Annotated entities:
- Device: "left ventricular assist device"